eGFR<40 ml/min at time of possible conversion

The above is a clinical trial exclusion criterion. Annotated with entity spans:
[Measurement: eGFR][Value: <40 ml/min] [Temporal: at time of possible conversion]